Clinical trial exclusion criterion:
Subjects with hypersensitivity reaction to Statin and Ezetimibe

Entity relations:
- AND("hypersensitivity", "Statin")
- OR("Statin", "Ezetimibe")